Psychotic disorders (e.g., schizophrenia)

The above is a clinical trial exclusion criterion. Annotated with entity spans:
[Condition: Psychotic disorders] (e.g., [Condition: schizophrenia])